Clinical trial exclusion criterion:
Has a CL prescription outside the range of the available parameters of the study lenses.

Annotated entities:
- Device: "CL prescription"
- Context_Error: "outside the range of the available parameters of the study lenses"
- Non-query-able: "outside the range of the available parameters of the study lenses"
- Qualifier: "outside the range of the available parameters of the study lenses"